下列脊神經（spinal n.）的分支中，何者只含感覺神經纖維？
A. 背側支（dorsal ramus）
B. 腹側支（ventral ramus）
C. 背根絲（dorsal rootlet）
D. 腹根絲（ventral rootlet）

正確答案：C. 背根絲（dorsal rootlet）